Clinical trial exclusion criterion:
Any significant abnormality or medical condition identified at the screening medical assessment (including serious psychological disorder) that in the Investigator's opinion, preclude entry into the study due to risk to the subject or that may interfere with the outcome of the study.

Entity relations:
- Has_qualifier("abnormality", "significant")
- OR("abnormality", "medical condition")